Clinical trial inclusion criterion:
Diagnosis of DM type 2 with A1-C >7 to 15

Annotated entities:
- Condition: "DM type 2"
- Measurement: "A1-C"
- Value: ">7 to 15"